Clinical trial inclusion criterion:
At the time of Visit 1, there is a plan to initiate IV antibiotics for a pulmonary exacerbation

Annotated entities:
- Drug: "IV antibiotics"
- Condition: "pulmonary exacerbation"
- Temporal: "At the time of Visit 1"
- Reference_point: "Visit 1"